Clinical trial inclusion criterion:
Patients of both sexes aged 35 to 65 years

Entity relations:
- Has_value("sexes", "both")
- Has_value("aged", "35 to 65 years")